ability to read short messages on the mobile phone

The above is a clinical trial inclusion criterion. Annotated with entity spans:
[Post-eligibility: ability to read short messages on the mobile phone]